Obstructive or restrictive pulmonary disease

The above is a clinical trial exclusion criterion. Annotated with entity spans:
[Condition: Obstructive] or [Condition: restrictive pulmonary disease]